Clinical trial exclusion criterion:
History of transjugular, intrahepatic, portosystemic shunt (TIPS) or vascular decompression surgery

Entity relations:
- Has_temporal("transjugular, intrahepatic, portosystemic shunt (TIPS)", "History")
- OR("transjugular, intrahepatic, portosystemic shunt (TIPS)", "vascular decompression surgery")